Which is the most common gene signature in Rheumatoid Arthritis patients?

Baseline disease activity measurements correlated with a type I IFN gene signature in the WB of subjects. The type I IFN signature negatively predicts the clinical response to rituximab treatment in patients with RA.